Clinical trial exclusion criterion:
currently pregnant, or trying to become pregnant

Entity relations:
- Has_mood("pregnant", "trying to become")
- Has_temporal("pregnant", "currently")
- OR("pregnant", "pregnant")